Clinical trial inclusion criterion:
3-17 years

Annotated entities:
- Person: "3-17 years"
- Value: "3-17 years"